鼓膜張肌（tensor tympani）由何神經支配？
A. 第五顱神經第三支
B. 副神經（accessory nerve）之顱根（cranial root），轉經迷走神經（vagus nerve）
C. 第八顱神經
D. 第七顱神經

正確答案：A. 第五顱神經第三支